Endogenous Cushing's

The above is a clinical trial exclusion criterion. Annotated with entity spans:
[Qualifier: Endogenous] [Condition: Cushing's]